Clinical trial exclusion criterion:
Allergy or hypersensitivity to topiramate

Annotated entities:
- Condition: "Allergy"
- Condition: "hypersensitivity"
- Drug: "topiramate"